Clinical trial inclusion criterion:
Patients with allergic contact dermatitis to para-phenylenediamine (PPD) based on a history of PPD contact dermatitis and positive PPD patch tests.

Annotated entities:
- Condition: "allergic contact dermatitis"
- Drug: "para-phenylenediamine (PPD)"
- Condition: "contact dermatitis"
- Drug: "PPD"
- Measurement: "PPD patch tests"
- Value: "positive"